Durante la segunda mitad del siglo XX son varias las teóricas enfermeras que desarrollan diferentes definiciones sobre la enfermería. ¿Cuál de las siguientes características puede considerarse común a todas ellas?:
1. Se centra en el paciente.
2. Se centra en la enfermedad.
3. Es una profesión femenina.
4. Tiene significado desde una perspectiva interprofesional.
5. Todas pueden considerarse comunes a todas las definiciones.

Respuesta correcta: 1. Se centra en el paciente.